Clinical trial inclusion criterion:
Exercise-limiting claudication established by history and direct observation during a screening walking test administered by the evaluating vascular surgeon,

Entity relations:
- Has_temporal("Exercise-limiting claudication", "history")
- AND("Exercise-limiting claudication", "direct observation")
- AND("Exercise-limiting claudication", "screening walking test")